Clinical trial exclusion criterion:
Subjects who donated >450 mL of blood within 60 days prior to any blood collection visits.

Entity relations:
- Has_index("within 60 days prior to any blood collection visits", "any blood collection visits")
- Has_value("donated blood", ">450 mL")
- Has_temporal("donated blood", "within 60 days prior to any blood collection visits")